下列有關利什曼原蟲之敘述中，何者正確？
A. 慢性感染巴西利什曼原蟲（Leishmania braziliensis）之患者，其耳朵軟骨常被侵蝕造成chiclero's ulcer
B. 嬰兒利什曼原蟲（Leishmania infantum）能侵入人體所有的有核細胞中分裂增殖
C. 杜氏利什曼原蟲（Leishmania donovani）是黑熱病（kala-azar）的致病原
D. 熱帶利什曼原蟲（Leishmania tropica）從未有導致內臟利什曼原蟲症（visceral leishmaniasis）的人體病例報告

正確答案：C. 杜氏利什曼原蟲（Leishmania donovani）是黑熱病（kala-azar）的致病原